Clinical trial inclusion criterion:
Adult male and female aged 19 to 75 years

Annotated entities:
- Person: "male"
- Person: "female"
- Person: "aged"
- Value: "19 to 75 years"